Clinical trial inclusion criterion:
The patient receive radical operation for colon cancer with negative margin.

Annotated entities:
- Procedure: "radical operation negative margin"
- Condition: "colon cancer"